History of chronic alcohol consumption and/or drug abuse.

The above is a clinical trial exclusion criterion. Annotated with entity spans:
[Temporal: History] of [Condition: chronic alcohol consumption] and/or [Condition: drug abuse].